Maximum 12 cm.

The above is a clinical trial inclusion criterion. Annotated with entity spans:
[Non-representable: Maximum 12 cm.]